Clinical trial inclusion criterion:
SCH (TSH: upper limits of normal (ULN) -10mIU/L, and FT4 level within reference range).

Annotated entities:
- Condition: "SCH"
- Measurement: "TSH"
- Value: "upper limits of normal (ULN) -10mIU/L"
- Measurement: "FT4 level"
- Value: "within reference range"